Clinical trial exclusion criterion:
History of sensitivity to any of the study medications, or components thereof or a history of drug or other allergy that, in the opinion of the investigator or GSK Medical Monitor, contraindicates their participation.

Annotated entities:
- Drug: "study medications"
- Context_Error: "study medications"
- Condition: "sensitivity to any of the study medications"
- Context_Error: "sensitivity to any of the study medications"
- Temporal: "History"
- Condition: "drug allergy"
- Condition: "allergy"
- Subjective_judgement: "in the opinion of the investigator or GSK Medical Monitor"
- Undefined_semantics: "contraindicates their participation"
- Subjective_judgement: "contraindicates their participation"